豬心移植於靈長類動物將發生超急性排斥（hyperacute rejection），此現象可以透過基因轉殖下列何種人類基因而減緩？
A. 免疫球蛋白-G（immunoglobulin-G）
B. 補體（complement）
C. CD（clusters of differentiation）52
D. CD（clusters of differentiation）59

正確答案：D. CD（clusters of differentiation）59